autoimmune diseases,

The above is a clinical trial exclusion criterion. Annotated with entity spans:
[Condition: autoimmune diseases],